What is known about the role of mHealth in the prevention of disease?

Most reported uses of mHealth are for treatment, we identified report on approaches to child obesity prevention.